Clinical trial exclusion criterion:
Uncontrolled bleeding tendency (prothrombin conc. Less than 70%)

Annotated entities:
- Qualifier: "Uncontrolled"
- Condition: "bleeding tendency"
- Measurement: "prothrombin"
- Value: "Less than 70%"